Please list 3 drugs that have EGFR as their primary target.

Cetuximab, erlotinib and gefitinib are 3 drugs that have EGFR as their primary target.